Individuals who have performed other restorations in the last 12 months;

The above is a clinical trial exclusion criterion. Annotated with entity spans:
Individuals who have performed [Procedure: other restorations] [Temporal: in the last 12 months];